Clinical trial exclusion criterion:
Patients with severe cardiac insufficiency patients taking Coumadin or other warfarin-containing agents with the exception of low dose warfarin (1 mg or less) for the maintenance of in-dwelling lines or ports

Entity relations:
- AND("severe cardiac insufficiency", "Coumadin")
- Has_qualifier("warfarin", "low dose")
- AND("severe cardiac insufficiency", "in-dwelling lines")
- Has_negation("warfarin", "with the exception of")
- AND("Coumadin", "warfarin")
- AND("Coumadin", "warfarin-containing agents")
- OR("Coumadin", "warfarin-containing agents")
- OR("low dose", "1 mg or less")
- OR("in-dwelling lines", "in-dwelling ports")